Clinical trial exclusion criterion:
Metabolic acidosis.

Annotated entities:
- Condition: "Metabolic acidosis"